En el confórmero tipo oxaciclohexano del azúcar -D-(+)-glucopiranosa:
1. Uno de los grupos OH- es axial, pero los restantes sustituyentes son ecuatoriales.
2. El grupo CH2OH es axial pero los restantes grupos son ecuatoriales.
3. Todos los grupos son axiales.
4. Todos los grupos son ecuatoriales.
5. El grupo CH2OH es ecuatorial pero los restantes grupos son axiales.

Respuesta correcta: 4. Todos los grupos son ecuatoriales.